What 3 disorders are commonly associated with Kaufman-McKusick syndrome?

McKusick-Kaufman Syndrome (MKKS) is a rare, recessively inherited syndrome reported mainly in young children. It is characterised by vaginal atresia with hydrometrocolpos, postaxial polydactyly, and congenital heart defect.